Clinical trial inclusion criterion:
Subjective visual loss > 6 weeks, interpreted as onset of active disease;

Entity relations:
- Has_temporal("Subjective visual loss", "> 6 weeks")